genital malformation

The above is a clinical trial exclusion criterion. Annotated with entity spans:
[Condition: genital malformation]